Males and females aged between 18 to 75 years.

The above is a clinical trial inclusion criterion. Annotated with entity spans:
[Person: Males] and [Person: females] [Person: aged] [Value: between 18 to 75 years].